一個 26 歲婦人 2 年內多次關節痛之病史。病人同時在兩頰有皮膚疹。病人雖有全身性淋巴腫大，但無關節腫脹或變形之情形。檢驗發現貧血、白血球減少、多株性丙球蛋白增加以及蛋白尿。血清學螢光免疫檢查抗核抗體（Antinuclear antibody, ANA）測試為 1：1024 倍陽性、為邊緣型。根據這些結果，醫師應告訴病人下列何種訊息？
A. 避免暴露於寒冷的環境中
B. 會有關節變形發生
C. 可能發生慢性腎衰竭之併發症
D. 日後終須做心臟瓣膜置換之手術

正確答案：C. 可能發生慢性腎衰竭之併發症